Clinical trial exclusion criterion:
Subjects with a history of asthma exacerbation requiring the use of systemic corticosteroids (tablets, suspension, or injection) for at least 3 days or a depot corticosteroid injection or emergency room attendance (within 3 months) or requiring hospitalization for asthma (within 6 months) prior to screening.

Annotated entities:
- Temporal: "history"
- Condition: "asthma exacerbation"
- Drug: "systemic corticosteroids"
- Temporal: "for at least 3 days"
- Drug: "depot corticosteroid injection"
- Temporal: "within 3 months"
- Procedure: "emergency room attendance"
- Procedure: "hospitalization"
- Condition: "asthma"
- Temporal: "within 6 months"